What is the mechanism of action of the biguanide class of diabetes drugs?

Bioguaides like Metformin, decrease amount of glucose released from liver and increases insulin sensitivity.